ASA IV-V

The above is a clinical trial exclusion criterion. Annotated with entity spans:
[Measurement: ASA] [Value: IV-V]